Thrombocytosis > 750K

The above is a clinical trial exclusion criterion. Annotated with entity spans:
[Measurement: Thrombocytosis] [Value: > 750K]